Patient works for OOO "NPF "MATERIA MEDICA HOLDING" (i.e., is the company's employee, temporary contract worker or appointed official responsible for carrying out the research or their immediate family).

The above is a clinical trial exclusion criterion. Annotated with entity spans:
Patient [Person: works for OOO "NPF "MATERIA MEDICA HOLDING"] (i.e., is the [Person: company's employee], [Person: temporary contract worker] or [Person: appointed official] [Observation: responsible for carrying out the research or their immediate family]).